Clinical trial exclusion criterion:
Patients having clinically significant abnormal laboratory, or ECG findings not resolved by further examinations.

Entity relations:
- Has_value("laboratory findings", "significant abnormal")
- OR("laboratory findings", "ECG findings")